Hemoglobin ≥ 8.0 g/dl

The above is a clinical trial inclusion criterion. Annotated with entity spans:
[Measurement: Hemoglobin] [Value: ≥ 8.0 g/dl]